RNA polymerase 有別於 DNA polymerase，因其：
A. 具校正功能
B. 可利用 nucleoside monophosphates 合成核酸
C. 在合成 RNA 時，不需要 RNA primer
D. 合成方向從 5' 端到 3' 端

正確答案：C. 在合成 RNA 時，不需要 RNA primer